Clinical trial inclusion criterion:
Have an indication for induction or attempted induction of labor according to Parkland protocol

Entity relations:
- AND("Parkland protocol", "indication")
- Has_qualifier("induction", "attempted")
- AND("indication", "induction of labor")
- OR("induction of labor", "induction")